Clinical trial exclusion criterion:
chronic diarrhea, any clinical signs of volume depletion or a hematocrit > 48 % (women) and > 53 % (men)

Entity relations:
- AND("hematocrit", "women")
- Has_value("hematocrit", "> 48 %")
- AND("hematocrit", "men")
- Has_value("hematocrit", "> 53 %")
- OR("hematocrit", "hematocrit")
- OR("chronic diarrhea", "volume depletion", "hematocrit")